measurable cutaneous or visceral metastasis

The above is a clinical trial inclusion criterion. Annotated with entity spans:
[Qualifier: measurable] [Condition: cutaneous] or [Condition: visceral metastasis]